Clinical trial inclusion criterion:
African American race

Annotated entities:
- Person: "race"
- Value: "African American"